Se entiende por sedación paliativa:
1. El uso de fármacos para reducir la consciencia, cuando otras terapias han sido efectivas, con el fin de paliar los síntomas del paciente contando con su consentimiento explícito, implícito o delegado.
2. El uso de fármacos para reducir la consciencia, cuando otras terapias no han sido efectivas, con el fin de paliar los síntomas del paciente contando con su consentimiento explícito, implícito o delegado.
3. El uso de fármacos para reducir la consciencia, cuando otras terapias no han sido efectivas, con el fin de paliar los síntomas del paciente según el criterio médico, exclusivamente.
4. El uso de fármacos para reducir la consciencia, cuando otras terapias no han sido efectivas, con el fin de paliar los síntomas del paciente sin contar con su consentimiento explícito, implícito o delegado.

Respuesta correcta: 2. El uso de fármacos para reducir la consciencia, cuando otras terapias no han sido efectivas, con el fin de paliar los síntomas del paciente contando con su consentimiento explícito, implícito o delegado.